El análisis de los datos obtenidos de los casos de enfermedad por el virus del Ébola en Guinea y Sierra Leona, nos permite afirmar que:
1. La mortalidad de la infección supera el 85 %.
2. El tratamiento está basado en medidas de soporte (reposición hidroelectrolítica i.v. y antibióticos).
3. Más de la mitad de los casos corresponde a personal sanitario.
4. La hemorragia gastrointestinal es una causa habitual de mortalidad.
5. La mortalidad es mayor en adolescentes.

Respuesta correcta: 2. El tratamiento está basado en medidas de soporte (reposición hidroelectrolítica i.v. y antibióticos).